Clinical trial exclusion criterion:
• Patients without PN during their hospitalization

Entity relations:
- Has_negation("PN", "without")
- Has_index("during their hospitalization", "their hospitalization")
- multi("their hospitalization", "hospitalization")
- Has_temporal("PN", "during their hospitalization")